Clinical trial exclusion criterion:
Long life major depression. Baseline scores =16 on the 17-item Hamilton Depression Scale at baseline.

Entity relations:
- Has_index("at baseline", "baseline")
- Has_temporal("17-item Hamilton Depression Scale", "at baseline")
- Has_value("17-item Hamilton Depression Scale", "=16")
- Subsumes("17-item Hamilton Depression Scale", "Baseline scores")
- AND("Long life major depression", "17-item Hamilton Depression Scale")